Clinical trial inclusion criterion:
Physical examination at screening period without clinically significant changes;

Annotated entities:
- Procedure: "Physical examination"
- Temporal: "at screening period"
- Reference_point: "screening period"
- Undefined_semantics: "Physical examination at screening period without clinically significant changes;"
- Subjective_judgement: "Physical examination at screening period without clinically significant changes;"